Patients who have received at least 1 transfusion per year in the last 2 years and who are expected to have a continuing requirement (based on Investigator's judgement) during the duration of the trial

The above is a clinical trial inclusion criterion. Annotated with entity spans:
Patients who have received [Multiplier: at least 1] [Procedure: transfusion] per year [Temporal: in the last 2 years] and who are [Condition: expected to have a continuing requirement] (based on Investigator's judgement) [Temporal: during the duration of the trial]